What are the 4 types of holoprosencephaly?

Four types of holoprosencephaly have been described: lobar, alobar, interhemispheric, and sacral. (PMID: 22990134)